當一個跑者快速向前跑，忽然遇到障礙物而必須於持續快跑中右轉，跑者能在此右轉過程維持平衡不跌倒，以下何者是協助維持此種動態平衡之主要結構？
A. Utricle
B. Saccule
C. Semicircular ducts
D. Basal ganglia

正確答案：C. Semicircular ducts